El movimiento de las vesículas desde su lugar de formación hacia el objetivo final se debe a:
1. Proteínas motoras asociadas a los largo de los microtúbulos.
2. Filamentos de actina y miosina.
3. Filamentos de vimentina.
4. Filamentos de queratina.

Respuesta correcta: 1. Proteínas motoras asociadas a los largo de los microtúbulos.